Absolute indication for anti-platelet therapy

The above is a clinical trial exclusion criterion. Annotated with entity spans:
[Mood: Absolute indication for] [Procedure: anti-platelet therapy]